Known sensitivity to any of the products administered during the study

The above is a clinical trial exclusion criterion. Annotated with entity spans:
Known [Condition: sensitivity] to [Drug: any of the products administered during the study]